Clinical trial inclusion criterion:
Patient can read and understand danish

Annotated entities:
- Non-query-able: "Patient can read and understand danish"